Patients with unstable CAD, assessed by the Cardiology team and defined as new onset angina, rest angina, rapidly increasing or crescendo angina

The above is a clinical trial exclusion criterion. Annotated with entity spans:
Patients with [Condition: unstable CAD], assessed by the Cardiology team and defined as [Condition: new onset angina], [Condition: rest angina], [Condition: rapidly increasing] or [Condition: crescendo angina]